Neuropsychiatric illness

The above is a clinical trial exclusion criterion. Annotated with entity spans:
[Condition: Neuropsychiatric illness]